Clinical trial inclusion criteria:
men and women 30-55 years with BMI 30-40 and waist 95 cm or more
normal OGTT
normal treadmill stress test
plus 2 of 4:
1. low serum levels of HDL cholesterol (<40 mg⁄dL for men or < 50 mg ⁄dL for women);
2. hypertriglyceridemia (triglyceride levels of 150 mg⁄dL or greater);
3. impaired glucose homeostasis (fasting plasma glucose concentration of 110 mg⁄dL or greater or glucose of 140 mg⁄dL or greater after OGTT or
4. hypertension (systolic blood pressure ≥ 140 or diastolic blood pressure ≥90 mmHg or treatment with antihypertensive drugs).

Annotated entities:
- Person: "men"
- Person: "women"
- Value: "30-55 years"
- Measurement: "BMI"
- Value: "30-40"
- Measurement: "waist"
- Value: "95 cm or more"
- Person: "30-55 years"
- Measurement: "OGTT"
- Value: "normal"
- Measurement: "treadmill stress test"
- Value: "normal"
- Multiplier: "2 of 4"
- Non-representable: "plus 2 of 4:"
- Parsing_Error: "plus 2 of 4:"
- Measurement: "serum levels of HDL cholesterol"
- Value: "low"
- Value: "<40 mg⁄dL"
- Value: "< 50 mg ⁄dL"
- Person: "men"
- Person: "women"
- Condition: "hypertriglyceridemia"
- Measurement: "triglyceride levels"
- Value: "150 mg⁄dL or greater"
- Condition: "impaired glucose homeostasis"
- Measurement: "fasting plasma glucose concentration"
- Value: "110 mg⁄dL or greater"
- Measurement: "glucose"
- Value: "140 mg⁄dL or greater"
- Procedure: "OGTT"
- Temporal: "after OGTT"
- Reference_point: "OGTT"
- Qualifier: "after OGTT"
- Condition: "hypertension"
- Measurement: "systolic blood pressure"
- Value: "≥ 140"
- Measurement: "diastolic blood pressure"
- Value: "≥90 mmHg"
- Procedure: "treatment"
- Drug: "antihypertensive drugs"